Subjects with hypersensitivity reaction to Statin and Ezetimibe

The above is a clinical trial exclusion criterion. Annotated with entity spans:
Subjects with [Condition: hypersensitivity] reaction to [Drug: Statin] and [Drug: Ezetimibe]